En relación con el colesevelam, indique la respuesta CORRECTA :
1. Es un agente alquilante con propiedades citotóxicas.
2. Es un anticuerpo monoclonal humanizado autorizado para el tratamiento de la psoriasis.
3. Es un fármaco antitrombótico utilizado en el tratamiento y prevención secundaria de episodios isquémicos.
4. Es una resina de intercambio iónico con propiedades hipolipemiantes.

Respuesta correcta: 4. Es una resina de intercambio iónico con propiedades hipolipemiantes.